肛門外括約肌由下列何者直接支配？
A. 腹下神經
B. 陰部神經
C. 肛門下神經
D. 骨盆內臟神經

正確答案：C. 肛門下神經